Clinical trial exclusion criterion:
1. Have dementia or delirium (as determined by the palliative care specialist) at study entry.

Entity relations:
- Has_temporal("dementia", "at study entry")
- OR("dementia", "delirium")